Clinical trial exclusion criterion:
poor health due to a current or past significant disease state or congenital abnormality.

Annotated entities:
- Condition: "poor health"
- Temporal: "current"
- Temporal: "past"
- Condition: "significant disease state"
- Condition: "congenital abnormality"